Clinical trial exclusion criterion:
use of medications that are inducers of CYP2A6 (a nicotine metabolizing enzyme) such as rifampicin, dexamethasone, phenobarbital, and other anti-convulsant drugs

Entity relations:
- Has_qualifier("medications", "inducers of CYP2A6")
- Subsumes("medications", "rifampicin")
- Subsumes("medications", "nicotine metabolizing enzyme")
- OR("rifampicin", "dexamethasone", "phenobarbital", "anti-convulsant drugs")